Clinical trial inclusion criterion:
Adult males and females who are 18 years of age or older.

Entity relations:
- OR("males", "females")